Primary or secondary amenorrhea for more than three months with LH and FSH> 30mUI/ml

The above is a clinical trial inclusion criterion. Annotated with entity spans:
[Qualifier: Primary] or [Qualifier: secondary] [Condition: amenorrhea] [Temporal: for more than three months] with [Measurement: LH] and [Measurement: FSH][Value: > 30mUI/ml]